Varón, 68 años, presenta calambres musculares, hipotensión, fasciculaciones y broncoconstricción. Ha estado utilizando plaguicidas organofosforados en la huerta. No ha utilizado mascarilla ni guantes. ¿Cuál sería el fármaco de elección para su tratamiento?
1. Carbidopa.
2. Acetilcolina.
3. Nicotina.
4. Flumazenilo.
5. Pralidoxima.

Respuesta correcta: 5. Pralidoxima.